Clinical trial inclusion criterion:
=18 years old males

Annotated entities:
- Value: "=18 years old"
- Person: "males"
- Person: "years"